Patients after throat surgeries: tonsillectomy, adenotonsillectomy, uvulopalatoplasty, uvulopalatopharyngoplasty

The above is a clinical trial inclusion criterion. Annotated with entity spans:
Patients after [Procedure: throat surgeries]: [Procedure: tonsillectomy], [Procedure: adenotonsillectomy], [Procedure: uvulopalatoplasty], [Procedure: uvulopalatopharyngoplasty]